一位60歲婦人因心跳過快、呼吸急促和胸部疼痛而被送到急診部，最近兩天有呼吸急促、下痢、出 及焦慮的症狀。醫生發現她兩個星期前服用的 methimazole已經沒有了，血中thyroid stimulating hormone （TSH）濃度小於0.04 mIU／mL （正常值為 4 mIU/mL～4.0 mIU/mL），確認為甲狀腺風暴。下列何者為治療甲狀腺風暴的最佳藥物？
A. epinephrine
B. propranolol
C. radioactive iodine
D. amiodarone

正確答案：B. propranolol